Clinical trial exclusion criterion:
Any liver disease in recipient

Annotated entities:
- Condition: "liver disease"